Clinical trial exclusion criterion:
Anemia (hemoglobin <8 g/dl)

Entity relations:
- Has_value("hemoglobin", "<8 g/dl")
- Subsumes("Anemia", "hemoglobin")